No prior antibiotic treatment

The above is a clinical trial inclusion criterion. Annotated with entity spans:
[Negation: No] [Temporal: prior] [Procedure: antibiotic treatment]